Intrauterine fetal death as confirmed by absence of cardiac motion on ultrasound by Attending physician at the time of admission to the hospital.

The above is a clinical trial inclusion criterion. Annotated with entity spans:
[Condition: Intrauterine fetal death] as confirmed by [Condition: absence of cardiac motion] on [Procedure: ultrasound] by Attending physician [Temporal: at the time of admission to the hospital].